Clinical trial exclusion criterion:
Depressed liver function

Annotated entities:
- Value: "Depressed"
- Measurement: "liver function"
- Condition: "Depressed liver function"